Clinical trial exclusion criterion:
Age less than one year or age greater than/equals to 18 years

Annotated entities:
- Person: "Age"
- Value: "less than one year"
- Value: "greater than/equals to 18 years"
- Person: "age"